Clinical trial exclusion criterion:
prostatic carcinoma

Annotated entities:
- Condition: "prostatic carcinoma"